Clinical trial exclusion criterion:
Dialysis for acute renal failure within the 6 previous months.

Annotated entities:
- Procedure: "Dialysis"
- Condition: "acute renal failure"
- Temporal: "within the 6 previous months"